Clinical trial exclusion criterion:
Poorly controlled diabetes mellitus (HbA1C > 7.5)

Annotated entities:
- Condition: "diabetes mellitus"
- Qualifier: "Poorly controlled"
- Measurement: "HbA1C"
- Value: "> 7.5"